Clinical trial exclusion criterion:
any contraindication for magnetic resonance imaging (MRI)

Annotated entities:
- Condition: "contraindication"
- Procedure: "magnetic resonance imaging"
- Procedure: "MRI"